Clinical trial exclusion criterion:
Active proliferative diabetic retinopathy (PDR) in the study eye such as NVE, NVD, vitreous hemorrhage, or neovascular glaucoma.

Annotated entities:
- Condition: "Active proliferative diabetic retinopathy (PDR)"
- Qualifier: "in the study eye"
- Condition: "NVE"
- Condition: "NVD"
- Condition: "vitreous hemorrhage"
- Condition: "neovascular glaucoma"